En el esquema de las etapas del desarrollo puberal de Tanner, el estadio o nivel 5 en las mujeres se corresponde con:
1. Ligera protuberancia del botón de la mama y aumento del tamaño areolar.
2. Crecimiento de la mama, presencia de ligero vello púbico y redondez de las caderas.
3. Ligera protuberancia mamaria y comienzo de redondez de las caderas.
4. Desarrollo completo de la mama y triángulo de vello púbico completo como en mujeres adultas.
5. El comienzo de la telarquia.

Respuesta correcta: 4. Desarrollo completo de la mama y triángulo de vello púbico completo como en mujeres adultas.